Clinical trial exclusion criterion:
History of immunodeficiency,

Annotated entities:
- Condition: "immunodeficiency"
- Temporal: "History"